下列何種方法對於處理乳癌手術後的上肢淋巴水腫（lymphedema）有最好的效果？
A. 冷熱交替（alternative heat and cold）療法
B. 向量干擾波（interferential current）治療
C. 服用利尿劑（diuretics）
D. 徒手淋巴引流法（manual lymph drainage）

正確答案：D. 徒手淋巴引流法（manual lymph drainage）